Clinical trial exclusion criterion:
require prednisone, methotrexate, or other immunosuppressing medications

Entity relations:
- Has_qualifier("immunosuppressing medications", "other")
- OR("prednisone", "methotrexate", "immunosuppressing medications")